Clinical trial inclusion criterion:
Patients with a life expectancy of greater than 1 year

Annotated entities:
- Observation: "life expectancy"
- Value: "greater than 1 year"